Señale la respuesta correcta. Respecto a las fases del Proceso de Atención de Enfermería, puede afirmarse que la última fase en incluirse con entidad propia en el actual modelo de cinco etapas fue:
1. Fase de evaluación.
2. Fase diagnóstica.
3. Fase de planificación.
4. Fase de ejecución.

Respuesta correcta: 2. Fase diagnóstica.